Indique cuál de los siguientes NO es un factor de riesgo de cáncer de mama:
1. Edad.
2. Primer embarazo después de los 30 años.
3. Menarquia después de los 12 años.
4. Menopausia tardía.

Respuesta correcta: 3. Menarquia después de los 12 años.